2. Patients who received ATG, Campath, or other T cell immunosuppressive monoclonal antibodies in the last 28 days

The above is a clinical trial exclusion criterion. Annotated with entity spans:
[Parsing_Error: 2.] Patients who received [Drug: ATG], [Drug: Campath], or other [Drug: T cell immunosuppressive monoclonal antibodies] [Temporal: in the last 28 days]